Non-ventilated Patients over the age of 65

The above is a clinical trial inclusion criterion. Annotated with entity spans:
[Negation: Non]-[Procedure: ventilated] Patients [Value: over] the [Person: age] of 65